Atendiendo a la finalidad de la entrevista ¿cuál sería la respuesta CORRECTA?
1. La entrevista diagnóstica tiene como objetivo prioritario orientar.
2. La entrevista de investigación tiene como objetivo prioritario operar un cambio.
3. La entrevista terapéutica tiene como objetivo prioritario establecer un diagnostico.
4. La entrevista de orientación vocacional tiene como objetivo prioritario asesorar sobre estudios o profesiones futuras.
5. La entrevista consultiva tiene como objetivo prioritario investigar sobre la propia técnica de evaluación.

Respuesta correcta: 4. La entrevista de orientación vocacional tiene como objetivo prioritario asesorar sobre estudios o profesiones futuras.